Any contraindication to neuraxial anesthesia (history of neurologic disease (e.g., multiple sclerosis, spinal stenosis, central or peripheral neuropathy)

The above is a clinical trial exclusion criterion. Annotated with entity spans:
Any [Condition: contraindication] to [Drug: neuraxial anesthesia] ([Temporal: history] of [Condition: neurologic disease] (e.g., [Condition: multiple sclerosis], [Condition: spinal stenosis], [Condition: central] or [Condition: peripheral neuropathy])